手腕隧道症候群（carpal tunnel syndrome）的患者，下列何者的功能較不受影響？
A. 手掌魚際區（thenar eminence）的感覺
B. 手的對掌動作
C. 大拇指的感覺
D. 第三指的感覺

正確答案：A. 手掌魚際區（thenar eminence）的感覺